Clinical trial exclusion criterion:
Have abnormal results for the following laboratory tests: serum 25(OH)D; serum creatinine; serum calcium; PTH; TSH

Entity relations:
- Has_value("serum 25(OH)D", "abnormal results")
- Has_value("serum creatinine", "abnormal results")
- Has_value("serum calcium", "abnormal results")
- Has_value("PTH", "abnormal results")
- Has_value("TSH", "abnormal results")